Patients with significant abnormalities in hepatic or renal function which would, in the opinion of the investigator, prevent the patients involvement in the study

The above is a clinical trial exclusion criterion. Annotated with entity spans:
Patients with significant [Condition: abnormalities in hepatic] or renal function which would, in the opinion of the investigator, prevent the patients involvement in the study